Patients with supine systolic blood pressure (SBP) = 180 mm Hg, or diastolic blood pressure (DBP) = 110 mm Hg.

The above is a clinical trial exclusion criterion. Annotated with entity spans:
Patients with [Qualifier: supine] [Measurement: systolic blood pressure] ([Measurement: SBP]) [Value: = 180 mm Hg], or [Measurement: diastolic blood pressure] ([Measurement: DBP]) [Value: = 110 mm Hg].